下列何者，不是急性心衰竭合併肺水腫的主要用藥？
A. 靜脈注射dopamine or dobutamine
B. 靜脈注射nitroglycerin
C. 靜脈注射利尿劑
D. 優先使用乙型交感神經阻斷劑（β-blocker）

正確答案：D. 優先使用乙型交感神經阻斷劑（β-blocker）